Clinical trial exclusion criterion:
Allergy to porphyrins and analogues; Photosensitivity; Porphyria; Allergic constitution;

Entity relations:
- AND("Allergy", "porphyrins")
- OR("Photosensitivity", "Allergic constitution", "Porphyria")
- OR("porphyrins", "analogues")